41 歲女性，G1P0，妊娠 16 週，血液檢查發現胎兒甲型蛋白（alpha-fetoprotein, AFP）過高，下列何者為最不可能的診斷？
A. 無腦兒
B. 脊柱裂
C. 唐氏症
D. 臍膨出

正確答案：C. 唐氏症